Clinical trial exclusion criterion:
periprocedural complications requiring continuation of heparin or administration of protamine sulfate

Entity relations:
- Has_mood("heparin", "requiring")
- AND("periprocedural complications", "heparin")
- OR("heparin", "protamine sulfate")